3. Cutaneous lesions and/or pressure ulcers

The above is a clinical trial exclusion criterion. Annotated with entity spans:
[Parsing_Error: 3.] [Condition: Cutaneous lesions] and/or [Condition: pressure ulcers]